Pre-existing eye diseases (glaucoma).

The above is a clinical trial exclusion criterion. Annotated with entity spans:
[Qualifier: Pre-existing] [Condition: eye diseases] ([Condition: glaucoma]).